質子幫浦阻斷劑（proton pump inhibitor）可能會抑制肝臟 cytochrome P450，使下列何種藥物的代謝受影響？
A. cholestyramine
B. captopril
C. penicillin
D. warfarin

正確答案：D. warfarin